Clinical trial inclusion criterion:
Hamilton Depression Rating Scale-17 score greater than 18.

Entity relations:
- Has_value("Hamilton Depression Rating Scale", "greater than 18")